Clinical trial inclusion criterion:
HIV negative or status unknown (as from the Ante-natal card)

Entity relations:
- Has_negation("HIV", "negative")
- OR("negative", "status unknown")